Serious and unstable medical illnesses including cardiovascular disease and cancer.

The above is a clinical trial exclusion criterion. Annotated with entity spans:
[Qualifier: Serious] and [Qualifier: unstable] [Condition: medical illnesses] including [Condition: cardiovascular disease] and [Condition: cancer].